Baseline anemia

The above is a clinical trial inclusion criterion. Annotated with entity spans:
[Temporal: Baseline] [Condition: anemia]